Clinical trial inclusion criterion:
Patients presenting for CMR with the clinical diagnosis of idiopathic dilated cardiomyopathy based upon left ventricular ejection fraction =40%, LV end-diastolic diameter =55 mm or left ventricular end-systolic diameter =45 mm, and the absence of coronary stenoses on angiography.

Entity relations:
- Has_value("left ventricular ejection fraction", "=40%")
- Has_negation("coronary stenoses", "absence")
- AND("angiography", "coronary stenoses")
- Has_value("left ventricular end-systolic diameter", "=45 mm")
- Has_value("LV end-diastolic diameter", "=55 mm")
- AND("idiopathic dilated cardiomyopathy", "angiography")
- AND("idiopathic dilated cardiomyopathy", "left ventricular ejection fraction")
- OR("left ventricular ejection fraction", "left ventricular end-systolic diameter", "LV end-diastolic diameter")